Clinical trial inclusion criterion:
Weight: equal to or over 35 kg.

Entity relations:
- Has_value("Weight", "equal to or over 35 kg")